肱骨在三角肌粗隆（deltoid tuberosity of humerus）位置的骨折，最可能直接傷及那一條神經？
A. 腋神經（axillary nerve）
B. 橈神經（radial nerve）
C. 尺神經（ulnar nerve）
D. 副神經（accessory nerve）

正確答案：B. 橈神經（radial nerve）